Clinical trial exclusion criterion:
History of severe, clinically significant brain or spinal cord trauma (e.g., cerebral contusion, spinal cord compression)

Annotated entities:
- Qualifier: "severe"
- Qualifier: "clinically significant"
- Condition: "spinal cord trauma"
- Condition: "brain trauma"
- Condition: "cerebral contusion"
- Condition: "spinal cord compression"